Clinical trial exclusion criteria:
Multiple pregnancy (more than 3 fetuses)
Maternal history of placental abruptio
Fetus with IUGR
Pregnancy complicated with pre-eclampsia
Unability to give informed consent

Annotated entities:
- Condition: "Multiple pregnancy"
- Value: "more than 3"
- Measurement: "fetuses"
- Condition: "placental abruptio"
- Temporal: "Maternal history of"
- Condition: "IUGR"
- Condition: "Fetus"
- Condition: "Pregnancy"
- Condition: "pre-eclampsia"
- Observation: "give informed consent"
- Negation: "Unability to"